目前台灣夜店十分流行的非法藥物「搖頭丸」，是屬於下列何種成分？
A. Ketamine
B. Heroin
C. MDMA
D. 大麻

正確答案：C. MDMA